Visible skin pathology, excessive freckles, or skin blemishes in the test area.

The above is a clinical trial exclusion criterion. Annotated with entity spans:
Visible [Condition: skin pathology], [Qualifier: excessive] [Condition: freckles], or [Condition: skin blemishes] in the test area.